Le envían a la consulta de hipertensión arterial los siguientes pacientes. Señale en cuál NO sospecharía una hipertensión secundaria.
1. Mujer de 25 años con un soplo abdominal.
2. Hipertensión arterial con hipopotasemia en un hombre de 50 años que no toma fármacos.
3. Mujer de 55 años con índice de masa corporal 28 y dislipemia.
4. Mujer de 78 años que desde hace 3 meses no se controla con 3 fármacos.
5. Hombre de 60 años con somnolencia diurna, cefalea matutina y roncador.

Respuesta correcta: 3. Mujer de 55 años con índice de masa corporal 28 y dislipemia.